Clinical trial exclusion criterion:
Subject has unstable angina pectoris.

Annotated entities:
- Condition: "unstable angina pectoris"